關於抗黴菌用藥ketoconazole與 fluconazole之比較，下列敘述何者錯誤？
A. Ketoconazole會抑制人類 cortisol之生成，fluconazole則較不會
B. Ketoconazole可治療由黴菌引起的腦膜炎，fluconazole則無法治療中樞性黴菌感染
C. Ketoconazole主要由肝臟代謝而失去藥效，fluconazole則由腎臟排出
D. Ketoconazole會抑制人類肝臟 cytochrome P450 之活性，fluconazole則較不會

正確答案：B. Ketoconazole可治療由黴菌引起的腦膜炎，fluconazole則無法治療中樞性黴菌感染